What does the SAGA complex acronym stands for?

SAGA stands for Spt-Ada-Gcn5-acetyltransferase (SAGA)